Which protein is targeted by Herceptin?

Her2 is targeted by Herceptin.